Clinical trial exclusion criterion:
serious infection (neutropenia, tuberculosis)

Annotated entities:
- Condition: "infection"
- Qualifier: "serious"
- Condition: "neutropenia"
- Condition: "tuberculosis"